Suspected or confirmed active TB disease

The above is a clinical trial exclusion criterion. Annotated with entity spans:
Suspected or confirmed [Condition: active TB] disease